Clinical trial inclusion criterion:
Patients with a diagnosis of osteoarthritis, traumatic arthritis, or avascular necrosis

Annotated entities:
- Condition: "osteoarthritis"
- Condition: "traumatic arthritis"
- Condition: "avascular necrosis"